Clinical trial exclusion criterion:
Prior therapy with agents targeting the DR5 apoptosis pathway

Annotated entities:
- Temporal: "Prior"
- Procedure: "therapy"
- Drug: "agents targeting the DR5 apoptosis pathway"